Has a history of not achieving comfortable CL wear (5 days per week; > 8 hours/day)

The above is a clinical trial exclusion criterion. Annotated with entity spans:
Has a [Temporal: history] of [Negation: not] achieving [Condition: comfortable CL wear] ([Temporal: 5 days per week]; [Temporal: > 8 hours/day])